Clinical trial exclusion criterion:
Current or planned pregnancy

Annotated entities:
- Temporal: "Current"
- Mood: "planned"
- Condition: "pregnancy"